preoperative systolic blood pressure <90 mmHg, or the heart rate <50/min.

The above is a clinical trial exclusion criterion. Annotated with entity spans:
[Measurement: preoperative systolic blood pressure] [Value: <90 mmHg], or the [Measurement: heart rate] [Value: <50/min].